Clinical trial exclusion criterion:
Taking therapeutic doses of anti-coagulants or anti-platelet therapy (prophylactic doses started because of hospital admission are not an exclusion)

Entity relations:
- Has_qualifier("anti-coagulants", "therapeutic")
- Has_qualifier("anti-coagulants", "prophylactic")
- OR("anti-coagulants", "anti-platelet therapy")
- NOT("prophylactic", "not")